下列對於全身性紅斑性狼瘡（SLE）病人血清中的各種自體抗體的描述，何者最為正確？
A. anti-RNP對於診斷SLE的特異性最高
B. anti-histone抗體與SLE的腎炎最有相關
C. anti-Sm與SLE的psychosis最有相關
D. anti-phospholipid與habitual fetal loss最有相關

正確答案：D. anti-phospholipid與habitual fetal loss最有相關